En relación con los procesos de audición y equilibrio indique qué afirmación es correcta:
1. Los sonidos se perciben en el órgano de Corti y el equilibrio en crestas ampulares y máculas.
2. La señal auditiva se procesa en el cerebelo.
3. El oído interno está lleno de aire.
4. Los otolitos están compuestos de cuarzo.
5. Todas las respuestas son falsas.

Respuesta correcta: 1. Los sonidos se perciben en el órgano de Corti y el equilibrio en crestas ampulares y máculas.